38 歲婦女，主訴不孕症 6 年，FSH: 45 mIU/mL，子宮輸卵管攝影正常，半年無月經，先生精液檢查 正常，如欲懷孕，此婦女可接受下列何種治療？
A. 注射 human chorionic gonadotropin
B. 人工授精
C. 接受卵子捐贈
D. 服用排卵藥

正確答案：C. 接受卵子捐贈